一位 75 歲女性，陰道間斷出血有 2 年之久，最近因為左側骨盆疼痛來婦產科求診，經檢查為陰道癌 3 公分位於上 1/2 陰道處，切片之細胞型態為鱗狀上皮癌（squamous cell carcinoma），內診發現腫瘤 侵犯左側骨盆壁（pelvic side wall），膀胱及直腸沒有侵犯，此病患最有可能之期別為：
A. stage I
B. stage II
C. stage III
D. stage IV

正確答案：C. stage III